Clinical trial exclusion criterion:
6. A platelet count less than 75,000 cells/mm3 or greater than 700,000 cells/mm3 or a WBC less than 3,000 cells/mm3.

Entity relations:
- Has_value("WBC", "less than 3,000 cells/mm3")
- Has_value("platelet count", "less than 75,000 cells/mm3")
- OR("less than 75,000 cells/mm3", "greater than 700,000 cells/mm3")
- OR("platelet count", "WBC")